下列何者不是常見的intradural extramedullary spinal tumor的種類？
A. meningioma
B. schwannoma
C. neurofibroma
D. anaplastic astrocytoma

正確答案：D. anaplastic astrocytoma